Clinical trial exclusion criterion:
liver disease

Annotated entities:
- Condition: "liver disease"